Clinical trial inclusion criterion:
Birth weight > 2500g

Entity relations:
- Has_value("Birth weight", "> 2500g")